Clinical trial exclusion criterion:
7. A serious underlying medical condition that would impair the ability of the patient to receive protocol treatment.

Annotated entities:
- Condition: "medical condition"
- Qualifier: "serious"
- Subjective_judgement: "serious"
- Post-eligibility: "A serious underlying medical condition that would impair the ability of the patient to receive protocol treatment."
- Condition: "impair the ability of the patient to receive protocol treatment"
- Mood: "would"